Clinical trial exclusion criterion:
Female subjects, who are of childbearing age (i.e. adolescent), who are pregnant or nursing;

Annotated entities:
- Pregnancy_considerations: "Female subjects, who are of childbearing age (i.e. adolescent), who are pregnant or nursing"